Clinical trial exclusion criterion:
Patients with a history of stroke or an acute cardiovascular event over the previous 12 months.

Annotated entities:
- Condition: "stroke"
- Procedure: "acute cardiovascular event"
- Temporal: "over the previous 12 months"